Hombre de 65 años sin antecedentes médicos de interés que consulta por chorro miccional fino, sensación de vaciado incompleto, frecuencia miccional diurna cada 3 horas y nicturia 1-2 veces. Al tacto rectal se aprecia próstata mediana-grande       sin  nódulos.     Antígeno prostático específico (PSA) 0,5 ng/mL. Aporta ecografía reno-vésico-prostática que nos indica un volumen prostático de 35 g, con ausencia de residuo postmiccional y sin otras alteraciones valorables. ¿Cuál será nuestra actitud ante este paciente?
1. Ofrecer     prostatectomía    radical    como tratamiento de su cáncer de próstata.
2. Solicitar    estudio    gammagráfico      para descartar la presencia de metástasis óseas y viscerales secundarias al cáncer de próstata.
3. Iniciar tratamiento con bloqueo androgénico con análogos LHRH dada la eficacia demostrada de este medicamento en el tratamiento del paciente con HBP.
4. Indicar tratamiento desobstructivo quirúrgico (resección transuretral de próstata) como tratamiento de elección de la hiperplasia de próstata.
5. Plantear tratamiento con alfa-bloqueantes como tratamiento inicial de la hiperplasia benigna de próstata (HBP).

Respuesta correcta: 5. Plantear tratamiento con alfa-bloqueantes como tratamiento inicial de la hiperplasia benigna de próstata (HBP).